中央健康保險局所公告的整合性家庭醫師服務制度試辦計畫中，所指稱的家庭醫師為：
A. 家庭醫學專科醫師
B. 所有開業的基層醫師
C. 加入社區醫療群的基層醫師
D. 一般科醫師

正確答案：C. 加入社區醫療群的基層醫師